Other medical conditions, that, in the investigator's judgment, make study participation not in the individual's best interest.

The above is a clinical trial exclusion criterion. Annotated with entity spans:
[Non-query-able: Other medical conditions, that, in the investigator's judgment, make study participation not in the individual's best interest.]